>7 Metabolic Equivalents

The above is a clinical trial inclusion criterion. Annotated with entity spans:
[Value: >7] [Measurement: Metabolic Equivalents]